下列何者為減毒性活菌疫苗？
A. 沙克疫苗（小兒麻痺注射疫苗）
B. 流行性感冒疫苗
C. 卡介苗（肺結核疫苗）
D. 破傷風疫苗

正確答案：C. 卡介苗（肺結核疫苗）